Clinical trial exclusion criterion:
concomitant drug medication; The following drugs cause drug interaction with S-1.

Entity relations:
- Has_temporal("drug", "concomitant")
- OR("drug", "medication")